Clinical trial exclusion criterion:
Severe comorbidity.

Entity relations:
- Has_qualifier("comorbidity", "Severe")